Is METTL3 an m6A writer, reader or eraser?

The methyltransferase METTL3 is an m6A writer.